G protein α-subunit 本身具下列何種酵素活性？
A. guanylate cyclase，催化轉換 GTP 成 cGMP
B. GTPase，水解 GTP 成 GDP
C. Kinase，催化轉移 GTP 磷酸根至蛋白質
D. cGMP-dependent protein kinase

正確答案：B. GTPase，水解 GTP 成 GDP